List the essential aminoacids.

Leucine
Isoleucine
Valine 
Tryptophan
Cysteine
Methionine
Lysine
Phenylalanine